Have a contraindication to NRT with no medical clearance from the primary care provider or study physician

The above is a clinical trial exclusion criterion. Annotated with entity spans:
Have a [Condition: contraindication] to [Procedure: NRT] with no medical clearance from the primary care provider or study physician